List R packages for lipidomics

Lipid Mini-On, lipidr, LipidMS and massPix